Willing and capable to have stimulation hardware permanently implanted, and to use the patient remote to activate the stimulation

The above is a clinical trial inclusion criterion. Annotated with entity spans:
[Post-eligibility: Willing and capable to have stimulation hardware permanently implanted, and to use the patient remote to activate the stimulation]